En la voltamperometría de barrido lineal:
1. Se utiliza siempre un electrodo de gota colgante de mercurio.
2. Potencial aplicado varía linealmente con el tiempo.
3. La corriente aplicada varía linealmente con el tiempo.
4. El tiempo no es una variable.

Respuesta correcta: 2. Potencial aplicado varía linealmente con el tiempo.